Clinical trial exclusion criterion:
Subject with cardiac pacemaker or other implanted electromedical device.

Entity relations:
- OR("cardiac pacemaker", "implanted electromedical device")